Clinical trial exclusion criterion:
Known Immunoglobulin E (IgE)-mediated hypersensitivity to eggs manifested as hives, swelling of the mouth and throat, difficulty in breathing, hypotension, or shock

Annotated entities:
- Condition: "Immunoglobulin E (IgE)-mediated hypersensitivity"
- Drug: "eggs"
- Condition: "hives"
- Condition: "swelling of the mouth"
- Condition: "swelling of the throat"
- Condition: "difficulty in breathing"
- Condition: "hypotension"
- Condition: "shock"